4. An ulcer positive for β-hemolytic streptococci upon culture

The above is a clinical trial exclusion criterion. Annotated with entity spans:
[Parsing_Error: 4.] An [Condition: ulcer] [Qualifier: positive for β-hemolytic streptococci] upon culture